Clinical trial exclusion criterion:
Active or recent drug or alcohol abuse

Annotated entities:
- Condition: "alcohol abuse"
- Temporal: "recent"
- Temporal: "Active"
- Condition: "drug abuse"